En la consulta de enfermería se está aplicando el test de Pfeiffer a F. P. de 80 años. De este instrumento se ha descrito que:
1. A diferencia de otras escalas de valoración cognitiva, solo valora memoria y orientación.
2. Es muy sensible para detectar pequeños cambios en la evolución del deterioro cognitivo.
3. La alteración del test es suficiente para establecer el diagnostico de demencia.
4. Es el más amplio y completo de todas las escalas de valoración cognitiva.
5. No detecta deterioros cognitivos muy leves.

Respuesta correcta: 5. No detecta deterioros cognitivos muy leves.